一位 46 歲男性糖尿病病人，有蛋白尿（proteinuria），且血壓介於 150/90 mmHg 至 160/94 mmHg 之間。首選藥物是下列那一種？
A. 乙型交感神經阻斷劑（β-adrenergic receptor blocker）
B. 甲型交感神經阻斷劑（α-adrenergic receptor blocker）
C. 利尿劑（diuretics）
D. angiotensin-converting enzyme inhibitor（ACEI）

正確答案：D. angiotensin-converting enzyme inhibitor（ACEI）